Clinical trial inclusion criterion:
Children with clinical diagnosis of PWS;

Entity relations:
- Has_qualifier("PWS", "clinical diagnosis")